臨床診斷感染性心內膜炎的Duke criteria，下列何者不屬於典型感染性心內膜炎的菌血症菌種？
A. Streptococcus bovis
B. 社區感染Staphylococcus aureus
C. 院內感染Enterococcus spp.
D. Coxiella burnetii

正確答案：C. 院內感染Enterococcus spp.